Known or suspected, acquired or bleeding or coagulation disorder in the subject or a first degree relative

The above is a clinical trial exclusion criterion. Annotated with entity spans:
[Mood: Known] or [Mood: suspected], [Condition: acquired] or [Condition: bleeding] or [Condition: coagulation disorder] [Person: in the subject] or a [Person: first degree relative]